En la clasificación del DSM-IV, dentro de los trastornos del estado de ánimo se incluye el trastorno bipolar. Se define como:
1. Síndrome que implica un conjunto de síntomas como la tristeza, culpa o pérdida del impulso vital.
2. Disminución de la capacidad para obtener placer, lo que lleva a la persona al aislamiento e improductividad.
3. Trastorno que se caracteriza por la presencia de episodios de euforia o depresión alternados con fase de eutimia.
4. Alteración inducida por sustancias que producen un estado de ánimo expansivo o irritable.
5. Estado afectivo de carácter relativamente autónomo y duradero en el tiempo.

Respuesta correcta: 3. Trastorno que se caracteriza por la presencia de episodios de euforia o depresión alternados con fase de eutimia.